Clinical trial inclusion criterion:
Age : 18-65

Entity relations:
- Has_value("Age", "18-65")